一位 36 歲男性台商，在中國大陸工作 3 年，因在大陸時曾與性工作者發生性行為，而至門診要求篩檢愛滋病，enzyme immunoassay（EIA）為陽性，下一步處置應以何項最適當？
A. 告知病人已經罹患愛滋病（AIDS）
B. 告知病人證實感染愛滋病毒
C. 建議執行西方墨點法（Western blot）檢驗以確定是否感染愛滋病毒
D. 立即投與抗愛滋病毒藥物

正確答案：C. 建議執行西方墨點法（Western blot）檢驗以確定是否感染愛滋病毒